In the opinion of the investigator, the volunteer is unlikely to comply with the study protocol

The above is a clinical trial exclusion criterion. Annotated with entity spans:
[Post-eligibility: In the opinion of the investigator, the volunteer is unlikely to comply with the study protocol]